Cardiac troponin I ≥ 0.2 ng/mL within 28 days of randomization.

The above is a clinical trial exclusion criterion. Annotated with entity spans:
[Measurement: Cardiac troponin I] [Value: ≥ 0.2 ng/mL] [Temporal: within 28 days of randomization].